Tolerating tuberculosis therapy containing rifampin for the 2 weeks prior to screening,except for persons taking protease inhibitors at time of diagnosis of TB.,. Subjects taking protease inhibitors will be screened and initiate visit 1 within 3 days of starting TB medication

The above is a clinical trial inclusion criterion. Annotated with entity spans:
Tolerating [Procedure: tuberculosis therapy] containing [Drug: rifampin] [Temporal: for the 2 weeks prior to screening],[Negation: except] for persons taking [Drug: protease inhibitors] [Temporal: at time of diagnosis of TB].,. Subjects taking protease inhibitors will be screened and initiate visit 1 within 3 days of starting TB medication